¿Cuál de los siguientes gases es el más abundante en el aire alveolar?
1. Oxígeno.
2. Anhídrido carbónico.
3. Vapor de agua.
4. Monóxido de carbono.
5. Nitrógeno.

Respuesta correcta: 5. Nitrógeno.